有關甲狀腺亢進與精神疾病的關聯性，下列何者正確？
A. 甲狀腺亢進可能引發情緒激躁、意念飛躍等躁症症狀，但不致於引起憂鬱情緒
B. 甲狀腺亢進不致於出現幻覺或被害意念之精神病症狀
C. 甲狀腺亢進與甲狀腺低下均可能引起認知障礙
D. 甲狀腺亢進會引起心跳加速，但不列入恐慌症之鑑別診斷

正確答案：C. 甲狀腺亢進與甲狀腺低下均可能引起認知障礙